Which is the effect of the HP1a protein on chromatin?

Heterochromatin-associated protein 1 (HP1a) mediates silencing and switching at the mating-type loci and is essential for pluripotency in Drosophila. HP1a belongs to a homologous family of histone-deacetyltransferases that mediate chromatin organization through the binding of histones to chromatin. The ATP-dependent chromatin-remodelling activity of HP1A is mediated, in part, by its interaction with histone H3 methyltransferase 3 (H3K9me2/3).